Clinical trial inclusion criterion:
An apnea-hypopnea index between 5-30 h-1

Entity relations:
- Has_value("apnea-hypopnea index", "between 5-30 h-1")